Person who cannot personally provide their consent.

The above is a clinical trial exclusion criterion. Annotated with entity spans:
[Informed_consent: Person who cannot personally provide their consent].